為了避免疫苗的嚴重不良反應，罹患severe combined immunodeficiency的兒童應該避免接種下列那一種疫苗？
A. 注射型小兒麻痺疫苗
B. 麻疹疫苗
C. 日本腦炎疫苗
D. 人類乳突病毒疫苗

正確答案：B. 麻疹疫苗